Patients who are on steroid therapy due to positive result of acute rejection test before the baseline.

The above is a clinical trial exclusion criterion. Annotated with entity spans:
Patients who are on [Drug: steroid] therapy due to [Value: positive] result of [Measurement: acute rejection test] before the baseline.